Diabetes Mellitus

The above is a clinical trial exclusion criterion. Annotated with entity spans:
[Condition: Diabetes Mellitus]